Clinical trial exclusion criterion:
Subject has a known allergy to titanium, polyethylene or polyester materials.

Annotated entities:
- Drug: "titanium"
- Drug: "polyethylene"
- Drug: "polyester"
- Condition: "allergy"